Clinical trial exclusion criterion:
Glomerular primary focal and segmental sclerosis

Annotated entities:
- Condition: "Glomerular primary focal sclerosis"
- Condition: "Glomerular segmental sclerosis"